Clinical trial exclusion criterion:
substance abuse/dependence (including alcohol)

Entity relations:
- Subsumes("substance abuse", "alcohol")
- OR("substance abuse", "substance dependence")